Which RNA polymerase II subunit carries RNA cleavage activity?

The eukaryotic transcription factor TFIIS enhances elongation and nascent transcript cleavage activities of RNA polymerase II in a stalled elongation complex.